Clinical trial inclusion criterion:
A male or female between, and including, 18 and 50 years of age at the time of the first study visit.

Entity relations:
- Has_value("age", "18 and 50 years")
- Has_index("at the time of the first study visit", "the first study visit")
- Has_temporal("age", "at the time of the first study visit")
- OR("male", "female")